En cuanto a la parada cardiorrespiratoria y la reanimación cardiopulmonar, señale la respuesta correcta:
1. En los adultos se debe seguir un ritmo de 65 compresiones por minuto.
2. La asistolia y la actividad eléctrica sin pulso son las arritmias más frecuentes en el adulto, siendo ambas ritmos desfibrilables.
3. La fibrilación ventricular y la asistolia, en el adulto, son ritmos desfibrilables.
4. Al inicio de una parada cardiorrespiratoria, la fibrilación ventricular o la taquicardia ventricular sin pulso son las arritmias más frecuentes en adultos.

Respuesta correcta: 4. Al inicio de una parada cardiorrespiratoria, la fibrilación ventricular o la taquicardia ventricular sin pulso son las arritmias más frecuentes en adultos.